關於皮質傳播性抑制（cortical spreading depression）的敘述，下列何者正確？
A. 由腦部額葉向枕葉方向傳遞
B. 傳導速度是每分鐘2～3公分
C. 後續會有血流降低的現象
D. 傳導的區域和血管分布的位置相關

正確答案：C. 後續會有血流降低的現象